Una mujer de 78 años de edad ha sido recientemente diagnosticada de diabetes mellitus tipo 2. Tiene historia de trombosis venosa profunda hace 5 años, hipertensión arterial, depresión y ansiedad generalizada. Toma hidroclorotiazida, lisinoprilo, citalopram y aspirina. Vive sola en unos apartamentos tutelados. Come poco, típicamente café y tostada para desayunar, fruta y medio sándwich para comer y ensalada para cenar. Camina 1,5 Km diariamente. Mide 152 cm y pesa 39 Kg. La presión arterial es 130/80 mmHg y la frecuencia cardiaca es 82 lpm. Los análisis de laboratorio incluyen glucemia basal de 147 mg/dL (hace 1 mes tenía 152 mg/dL), creatinina 1,0 mg/dL (filtrado glomerular estimado 28 ml/min), urea 32 mg/dL y hemoglobina glicosilada es 9,5%. ¿Cuál de los siguientes es el mejor tratamiento inicial para la diabetes?
1. Insulina glargina subcutánea 8 U al día.
2. Metformina oral a dosis de 850 mg cada 12 horas.
3. Glibenclamida oral 10 mg al día.
4. No necesita tratamiento farmacológico, solo dieta.
5. Pioglitazona 15 mg al día.

Respuesta correcta: 1. Insulina glargina subcutánea 8 U al día.